Clinical trial exclusion criteria:
1) preoperative diagnosis of delirium or dementia; 2) MMSE score of = 20 out of 30 on preoperative testing (more than mild cognitive impairment) or delirium on preoperative CAM testing; 3) language barriers that would preclude testing; 4) preoperative steroid use within 3 days of surgery; or 5) anticipation of postoperative intubation.

Annotated entities:
- Line: "1) preoperative diagnosis of delirium or dementia;"
- Line: "2) MMSE score of = 20 out of 30 on preoperative testing (more than mild cognitive impairment) or delirium on preoperative CAM testing;"
- Line: "3) language barriers that would preclude testing;"
- Line: "4) preoperative steroid use within 3 days of surgery;"
- Line: "5) anticipation of postoperative intubation."
- Condition: "delirium"
- Condition: "dementia"
- Temporal: "preoperative"
- Measurement: "MMSE score"
- Value: "= 20 out of 30"
- Temporal: "preoperative"
- Qualifier: "more than mild"
- Condition: "cognitive impairment"
- Condition: "delirium"
- Temporal: "preoperative"
- Procedure: "CAM testing"
- Observation: "language barriers"
- Temporal: "preoperative"
- Drug: "steroid"
- Temporal: "within 3 days of surgery"
- Reference_point: "surgery"
- Procedure: "surgery"
- Temporal: "postoperative"
- Procedure: "intubation"
- Mood: "anticipation"